Clinical trial exclusion criterion:
High bleeding risk surgeries, e.g., Intra-cranial surgery, Intra-spinal surgery, Retinal surgery

Entity relations:
- Subsumes("High bleeding risk surgeries", "Intra-cranial surgery")
- OR("Intra-cranial surgery", "Intra-spinal surgery", "Retinal surgery")